Respecto a los diseños de los ensayos clínicos para demostrar eficacia de los antidepresivos, ¿cuál de las siguientes es FALSA?
1. La inclusión en el diseño de los ensayos clínicos de variables secundarias de seguridad es importante para poder establecer la ubicación terapéutica de los medicamentos estudiados.
2. En estudios de depresión no se considera ético usar un grupo de control con placebo.
3. La eficacia de los antidepresivos se mide mediante la proporción de sujetos con una reducción porcentual predeterminada en las escalas de depresión específicas, como la de Hamilton o la de Beck.
4. Debido a la gran variabilidad de la respuesta entre un estudio y otro, las comparaciones entre fármacos activos con un diseño de no inferioridad no permiten concluir eficacia de forma robusta.
5. Aunque la mejoría clínica se puede observar en una o dos semanas, generalmente son necesarias 4 semanas de seguimiento en los ensayos clínicos para establecer diferencias significativas.

Respuesta correcta: 2. En estudios de depresión no se considera ético usar un grupo de control con placebo.